Clinical condition of the patient allows to carry out induction therapy: ECOG performance status: ≤ 2 and the Hematopoietic Cell Transplant-Co-morbidity Index (HCT-I): ≤3

The above is a clinical trial inclusion criterion. Annotated with entity spans:
Clinical condition of the patient allows to carry out induction therapy: [Measurement: ECOG performance status]: [Value: ≤ 2] and the [Measurement: Hematopoietic Cell Transplant-Co-morbidity Index (HCT-I)]: [Value: ≤3]